Effective methods of birth control include: surgically sterile, barrier device (condom, diaphragm), contraceptive coil, intrauterine device (IUD), and abstinence.

The above is a clinical trial inclusion criterion. Annotated with entity spans:
Effective methods of [Procedure: birth control] include: [Condition: surgically sterile], [Device: barrier device] ([Device: condom], [Device: diaphragm]), [Device: contraceptive coil], [Device: intrauterine device (IUD)], [Grammar_Error: and] [Procedure: abstinence].